Unable to provide informed consent

The above is a clinical trial exclusion criterion. Annotated with entity spans:
[Informed_consent: Unable to provide informed consent]